Clinical trial inclusion criterion:
Male or pre-menarchial female subjects.

Annotated entities:
- Person: "Male"
- Person: "pre-menarchial"
- Person: "female"